Clinical trial exclusion criterion:
Current use of tobacco products;

Annotated entities:
- Observation: "use of tobacco products"
- Temporal: "Current"